Clinical trial inclusion criterion:
• Enthesitis (heel) physician-diagnosed (spontaneous pain or tenderness at examination of the site of the insertion of the Achilles tendon or plantar fascia)

Entity relations:
- Has_qualifier("Enthesitis", "heel")
- Has_qualifier("pain", "site of the insertion of the Achilles tendon")
- OR("pain", "tenderness")
- OR("site of the insertion of the Achilles tendon", "plantar fascia")